Clinical trial inclusion criterion:
Patients over 18 years old

Entity relations:
- Has_value("old", "over 18 years")